Congestive heart failure within 6 mo and LVEF < 45%

The above is a clinical trial exclusion criterion. Annotated with entity spans:
[Condition: Congestive heart failure] [Temporal: within 6 mo] and [Measurement: LVEF] [Value: < 45%]